腎絲球過濾液中大部分的重碳酸離子（HCO3-）在腎小管何處回收（reabsorption）？
A. 近端腎小管
B. 亨利氏環粗上升支
C. 遠端腎小管
D. 集尿小管

正確答案：A. 近端腎小管